Clinical trial exclusion criteria:
severe behavioral issues
presence of fistula or abscess near the selected tooth
presence of pulp exposure in the selected tooth
presence of mobility in the selected tooth

Annotated entities:
- Condition: "behavioral issues"
- Qualifier: "severe"
- Condition: "fistula"
- Condition: "abscess"
- Qualifier: "near the selected tooth"
- Condition: "pulp exposure"
- Qualifier: "selected tooth"
- Condition: "mobility"
- Qualifier: "selected tooth"